下列由遺傳因素造成的畸形中，何者是因染色體數目的異常所致？
A. 亨丁頓氏舞蹈症（Huntington chorea）
B. 軟骨發育不全（achondroplasia）
C. 克萊恩費爾特氏徵候群（Klinefelter syndrome）
D. 血友病（hemophilia）

正確答案：C. 克萊恩費爾特氏徵候群（Klinefelter syndrome）